Clinical trial exclusion criterion:
History of chronic pain

Entity relations:
- Has_temporal("chronic pain", "History")